Clinical trial inclusion criterion:
Able to comply with protocol requirements. Healthy on the basis of a medical evaluation that reveals the absence of any clinically relevant abnormality and includes a physical examination, medical history, electrocardiogram (ECG), vital signs, and the results of blood biochemistry, blood coagulation, and hematology tests and a urinalysis carried out at screening.

Entity relations:
- Subsumes("electrocardiogram", "ECG")
- Has_index("at screening", "screening")
- Has_qualifier("abnormality", "clinically relevant")
- Has_negation("abnormality", "absence")
- AND("medical evaluation", "physical examination")
- AND("medical evaluation", "abnormality")
- Has_temporal("medical evaluation", "at screening")
- AND("medical evaluation", "Healthy")
- AND("medical evaluation", "medical history")
- AND("medical evaluation", "electrocardiogram")
- AND("medical evaluation", "vital signs")
- AND("medical evaluation", "blood biochemistry tests")
- AND("medical evaluation", "blood coagulation tests")
- AND("medical evaluation", "hematology tests")
- AND("medical evaluation", "urinalysis")